Clinical trial inclusion criterion:
Basal follicle-stimulating hormone (FSH) <=12 International unit per liter (IU/L)

Entity relations:
- Has_value("Basal follicle-stimulating hormone (FSH)", "<=12 International unit per liter (IU/L)")